Clinical trial inclusion criterion:
Clinically stable and on stable triple therapy with an ICS/LABA and tiotropium;

Entity relations:
- AND("stable triple therapy", "ICS/LABA")
- AND("stable triple therapy", "tiotropium")